Uncontrolled hypertension

The above is a clinical trial exclusion criterion. Annotated with entity spans:
[Condition: Uncontrolled hypertension]